Which type of sarcoma has been associated with members of the oral microbiome?

Alterations in the oral microbiota in the immunosuppressed population may be associated with diseases such as Kaposi's sarcoma.